La biodisponibilidad oral de un fármaco puede disminuir al aumentar la dosis si:
1. Se satura su metabolismo presistémico.
2. La absorción es mediante difusión pasiva transcelular.
3. Existen limitaciones en su solubilidad y velocidad de disolución.
4. La absorción es mediante difusión pasiva paracelular.

Respuesta correcta: 3. Existen limitaciones en su solubilidad y velocidad de disolución.